¿En qué parte de la célula se sintetiza el RNA ribosómico?:
1. Nucleolo.
2. Ribosomas.
3. Vacuolas.
4. Aparato de Golgi.
5. Retículo endoplásmico.

Respuesta correcta: 1. Nucleolo.